Respecto a la utilización de la realidad virtual en exposición, ¿cuál es la respuesta correcta?
1. Sustituye totalmente a la exposición real.
2. Cualquier estímulo real puede programarse con exactitud de forma virtual.
3. La realidad virtual permite que el terapeuta construya un entorno clínicamente significativo.
4. Los estudios indican mejores resultados frente a las técnicas imaginativas.
5. Los pacientes no suelen presentar dificultades en el contexto virtual.

Respuesta correcta: 3. La realidad virtual permite que el terapeuta construya un entorno clínicamente significativo.